What is the indication for zolmitriptan?

zolmitriptan is approved for the treatment of migraine.